Clinical trial exclusion criterion:
Presence of a preexisting significant GI condition that does not have a presumed causal relationship with MPA

Entity relations:
- Has_qualifier("GI condition", "significant")
- Has_temporal("GI condition", "preexisting")